一位 43 歲男性病人，自述每次進食短時間內就會感到臉頰腫脹疼痛，進食完症狀就會改善，此情形已經持續數月。打開病人口腔發現有舌下黏膜處腫脹，進一步觸診發現口腔底深處有一硬塊，擠壓時伴隨有膿液排出。關於此病人的敘述何者錯誤？
A. 可能為涎石病（sialolithiasis）
B. 此病常需要和耳下腺炎（parotitis）鑑別診斷
C. 病灶較少出現在下頜腺（submandibular gland）
D. 用 X 光檢查可輔助診斷

正確答案：C. 病灶較少出現在下頜腺（submandibular gland）